¿Cómo se lleva a cabo la corrección de un aminoácido erróneo incorporado en el proceso de traducción en el ribosoma?
1. No hay posibilidad de eliminación de un aminoácido en la síntesis de proteínas.
2. Mediante la actividad aminoacil peptidasa del ribosoma.
3. Una dipeptidasa quita el aminoácido equivocado, antes de proseguir con la síntesis.
4. Gracias a que los aminoácidos son moléculas ricas en energía.
5. Existe un sistema postraduccional de revisión de secuencia.

Respuesta correcta: 1. No hay posibilidad de eliminación de un aminoácido en la síntesis de proteínas.